Clinical trial inclusion criterion:
Adult patients (18years old or older) undergoing living-donor or deceased-donor liver transplantation

Entity relations:
- Has_value("years", "18years old or older")
- Subsumes("Adult", "years")
- OR("living-donor liver transplantation", "deceased-donor liver transplantation")